History of rhegmatogenous retinal detachment, retinal tear(s), or traction retinal detachments in the study eye.

The above is a clinical trial exclusion criterion. Annotated with entity spans:
[Temporal: History of] [Condition: rhegmatogenous retinal detachment], [Condition: retinal tear(s)], or [Condition: traction retinal detachments] [Qualifier: in the study eye].